Suicidal ideation with intent to act or with specific plan and intent in the past 6 months (Type 4 - 5 ideation on the Columbia Suicide Severity Rating Scale) or a concerning history of prior suicidal behavior.

The above is a clinical trial exclusion criterion. Annotated with entity spans:
[Condition: Suicidal ideation] with intent to act or with specific plan and intent in the [Temporal: past 6 months] ([Value: Type 4] - 5 ideation on the [Measurement: Columbia Suicide Severity Rating Scale]) or a concerning history of prior [Condition: suicidal behavior.]